Clinical trial exclusion criterion:
Being currently at risk for suicide

Annotated entities:
- Observation: "risk for suicide"